Clinical trial inclusion criterion:
Taking an NNRTI or integrase containing regimen without prior history of use of PI for more than 2 weeks

Entity relations:
- Has_value("PI", "for more than 2 weeks")
- Has_temporal("PI", "prior")
- Has_negation("PI", "without")
- AND("regimen", "NNRTI")
- OR("NNRTI", "integrase")